下列那一種病毒可以穿過人體皮膚而造成感染？
A. 腺病毒（Adenovirus）
B. 輪狀病毒（Rotavirus）
C. 鼻病毒（Rhinovirus）
D. 乳突瘤病毒（Papillomavirus）

正確答案：D. 乳突瘤病毒（Papillomavirus）